Any fracture in the leg to be measured within 6 months prior to the screening visit.

The above is a clinical trial exclusion criterion. Annotated with entity spans:
Any [Condition: fracture in the leg] to be measured [Temporal: within 6 months prior to the screening visit].